Clinical trial exclusion criterion:
Diabetes (to improve the PET imaging quality)

Annotated entities:
- Condition: "Diabetes"
- Procedure: "PET imaging quality"